tortuousity (greater than 60 degree angle) that makes it unsuitable for proper stent delivery and deployment,

The above is a clinical trial exclusion criterion. Annotated with entity spans:
[Condition: tortuousity] ([Value: greater than 60 degree] [Measurement: angle]) that makes it [Qualifier: unsuitable for proper] [Procedure: stent delivery and deployment],